老人疾病的特徵不包括下列何者？
A. 合併多重性疾病
B. 典型表現
C. 潛隱性疾病
D. 易有醫源性問題

正確答案：B. 典型表現